下列何種囊性腎病的預後最差？
A. Adult polycystic kidney  disease
B. Infantile polycystic kidney disease
C. Medullary sponge kidney
D. Cystic renal dysplasia

正確答案：B. Infantile polycystic kidney disease